依據美國精神醫學會出版的「精神疾病診斷和統計手冊第四版」，下列有關第二型雙極性疾患（bipolar II disorder）之敘述，何者正確？
A. 包括輕躁發作（hypomanic episode）及輕鬱發作（minor depressive episode）
B. 憂鬱症病人服用抗鬱劑出現輕躁時，診斷應改成第一型雙極性疾患（bipolar I disorder）
C. 第二型雙極性疾患（bipolar II disorder）發病年紀較第一型雙極性疾患（bipolar I disorder）早，且有較多的婚姻問題
D. 第二型雙極性疾患（bipolar II disorder）企圖自殺及自殺死亡率較第一型雙極性疾患（bipolar I disorder）為低

正確答案：C. 第二型雙極性疾患（bipolar II disorder）發病年紀較第一型雙極性疾患（bipolar I disorder）早，且有較多的婚姻問題